Clinical trial exclusion criterion:
Use of any other endoscopic method to stop GI bleeding beyond endoscopic band ligation

Annotated entities:
- Negation: "any other"
- Procedure: "endoscopic method"
- Condition: "GI bleeding"
- Procedure: "endoscopic band ligation"